Clinical trial inclusion criterion:
Age 3 to 18 years on day of surgery

Entity relations:
- Has_value("Age", "3 to 18 years")
- Has_temporal("Age", "on day of surgery")